Clinical trial exclusion criterion:
Co-morbidities that require corticosteroid therapy (e.g. asthma, inflammatory bowel disease).

Entity relations:
- AND("Co-morbidities", "corticosteroid therapy")
- Subsumes("Co-morbidities", "asthma")
- OR("asthma", "inflammatory bowel disease")